85 歲老人死後解剖，心臟呈黃褐色外觀，重量約 180 gm，最可能的組織表現為：
A. 心肌肥大
B. 脂褐質（lipofuscin）沈積
C. 鐵質沈積
D. 脂肪變性

正確答案：B. 脂褐質（lipofuscin）沈積